Clinical trial exclusion criterion:
Hypersensitivity to the active substance, to FCM or any of its excipients

Annotated entities:
- Condition: "Hypersensitivity"
- Drug: "active substance"
- Drug: "FCM"
- Drug: "excipients"